What kind of approaches you need to combine in order to manage Familial spontaneous pneumothorax?

Combining clinical, radiological and genetic approaches to pneumothorax management is a critical step in managing family history and family history-based causes of spontaneous pneumothorsic disease (FPSD) in children and adults who have a family history of FPSD and are at high risk for the disease because of family history.